Thyroid disease with thyroid function poorly controlled on prescribed medications. Patients with abnormal thyroid stimulating hormone or T4 concentrations, with elevation of antibodies to thyroid peroxidase and any clinical manifestations of thyroid disease are excluded.

The above is a clinical trial exclusion criterion. Annotated with entity spans:
[Condition: Thyroid disease] with [Measurement: thyroid function] [Value: poorly controlled] [Qualifier: on prescribed medications]. Patients with [Value: abnormal] [Measurement: thyroid stimulating hormone] or [Measurement: T4 concentrations], with [Value: elevation] of [Measurement: antibodies to thyroid peroxidase] and any [Condition: clinical manifestations of thyroid disease] are excluded.